Vegetarians, vegans or patients with religious dietary restrictions (as the standard meal contains meat)

The above is a clinical trial exclusion criterion. Annotated with entity spans:
[Person: Vegetarians], vegans or patients with religious dietary restrictions (as the standard meal contains meat)